Clinical trial exclusion criteria:
current alcohol abuse or drug dependence
pregnancy
active opportunistic infection or significant co-morbidities
current prohibited concomitant medication
a likelihood of diminished response to any of the study treatment arms, in the opinion of the investigator, based on HIV genotypic resistance testing

Annotated entities:
- Condition: "alcohol abuse"
- Condition: "drug dependence"
- Temporal: "current"
- Condition: "pregnancy"
- Condition: "opportunistic infection"
- Condition: "co-morbidities"
- Qualifier: "significant"
- Undefined_semantics: "significant"
- Drug: "medication"
- Temporal: "concomitant"
- Temporal: "current"
- Qualifier: "prohibited"
- Post-eligibility: "a likelihood of diminished response to any of the study treatment arms, in the opinion of the investigator, based on HIV genotypic resistance testing"